Clinical trial inclusion criterion:
T2DM: Diagnosed according to the WHO criteria [53].

Annotated entities:
- Condition: "T2DM"
- Qualifier: "WHO criteria"